下列何者不是子宮內膜癌的危險因子？
A. 多產
B. 肥胖
C. 高血壓
D. 雌激素治療

正確答案：A. 多產